Clinical trial exclusion criterion:
Patients with upper face botulinum toxin injection in the past 12 months

Annotated entities:
- Procedure: "botulinum toxin injection"
- Qualifier: "upper face"
- Temporal: "in the past 12 months"